Which drugs were tested in the KEYNOTE-006 study?

KEYNOTE-006 study compared pembrolizumab versus ipilimumab for advanced melanoma.